50歲男性業務經理，因倦怠、性慾減少、陽痿來診。病人已婚育有一子20歲，自覺症狀自5年前開始每況愈下。病人自認工作勝任愉快、夫妻關係良好。經泌尿科診治，抽血檢查：FSH 2 mIU/mL，LH 1 mIU/mL，testosterone 0.4 ng/mL皆比正常人為低，給予睪固酮注射症狀改善。下列敘述何者最為恰當？
A. 此為男性更年期，可以睪固酮症狀治療
B. 睪丸應小而硬
C. 應測定血中乳促素（prolactin）濃度
D. 應以超音波測量陰莖血流

正確答案：C. 應測定血中乳促素（prolactin）濃度